Metastatic cervical cancer (CX)

The above is a clinical trial inclusion criterion. Annotated with entity spans:
[Condition: Metastatic cervical cancer] (CX)